Clinical trial exclusion criterion:
History of decreased LVEF or symptomatic congestive heart failure (CHF) with previous adjuvant trastuzumab treatment.

Entity relations:
- Has_qualifier("congestive heart failure (CHF)", "symptomatic")
- Has_value("LVEF", "decreased")
- Has_qualifier("trastuzumab", "adjuvant")
- Has_temporal("trastuzumab", "previous")
- Has_temporal("LVEF", "History")
- Has_temporal("congestive heart failure (CHF)", "History")
- Has_temporal("trastuzumab", "History")
- OR("LVEF", "congestive heart failure (CHF)")